Patient is pregnant, lactating, or planning to become pregnant within 12 months

The above is a clinical trial inclusion criterion. Annotated with entity spans:
Patient is [Condition: pregnant], [Condition: lactating], or [Mood: planning to become] [Condition: pregnant] [Temporal: within 12 months]